一位 62 歲女性，停經 5 年，近二年因性交疼痛，反覆性泌尿道感染，使用局部荷爾蒙補充，此次因陰道出血求診，超音波下內膜厚 0.8 公分。下列檢查何者優先？
A. 腹部電腦斷層
B. 子宮內膜切片
C. 荷爾蒙劑量不足，應改為口服劑型
D. 荷爾蒙劑量不足，應增加使用次數

正確答案：B. 子宮內膜切片